El método de elección para la esterilización de productos estables al calor pero sensibles a la humedad es:
1. Esterilización por calor seco.
2. Filtración.
3. Radiación UV.
4. Autoclavado.
5. Esterilización por calor húmedo.

Respuesta correcta: 1. Esterilización por calor seco.